What phenotype is associated with the V60L mutation in the human MC1R gene?

Red hair is usually inherited as a recessive characteristic with the R151C, R160W, D294H, R142H, 86insA and 537insC alleles at this locus. The V60L variant, which is common in the population may act as a partially penetrant recessive allele.  V60L is a mutation also associated to red hair and fair skin and even blonde hair.